Wheezing

The above is a clinical trial inclusion criterion. Annotated with entity spans:
[Condition: Wheezing]